Clinical trial exclusion criterion:
Medical or psychological condition that would not permit completion of the trial or signing of informed consent

Annotated entities:
- Informed_consent: "Medical or psychological condition that would not permit completion of the trial or signing of informed consent"